Clinical trial exclusion criterion:
Patients anticipated to receive adjunctive C. difficile therapy (rifaxamin, nitazoxanide, tigecycline) after enrollment.

Annotated entities:
- Mood: "anticipated"
- Procedure: "C. difficile therapy"
- Drug: "rifaxamin"
- Drug: "nitazoxanide"
- Drug: "tigecycline"